欲由登革熱患者身上分離病毒時，取患者下列那種檢體最適合？
A. 喉頭拭子（throat swab）
B. 血液
C. 皮膚
D. 肛門拭子（anal swab）

正確答案：B. 血液